Una mujer de 76 años acude a urgencias refiriendo dolor en la ingle derecha y vómitos desde hace unas 6 horas. A la exploración se palpa una tumoración de consistencia dura justo por debajo de la línea que une la espina iliaca anterosuperior y el pubis (que se corresponde con la localización del ligamento inguinal). Lo más probable es que se trate de una:
1. Hernia inguinal directa.
2. Hernia de Spiegel.
3. Hernia inguinal indirecta.
4. Hernia femoral (crural).
5. Hernia obturatriz.

Respuesta correcta: 4. Hernia femoral (crural).